Clinical trial exclusion criterion:
Bilirubin greater than 2 times ULN.

Entity relations:
- Has_value("Bilirubin", "greater than 2 times ULN")